一位 25 歲男子，二年前曾發生一次視力模糊和走路困難現象，但恢復情況良好。今年發生吞嚥困難，兩側下肢無力且有尿失禁現象，則下列何者是最可能的疾病診斷？
A. 神經性梅毒（neurosyphilis）
B. 多發性硬化症（multiple sclerosis）
C. 脊髓空洞症（syringomyelia）
D. 脊髓炎（myelitis）

正確答案：B. 多發性硬化症（multiple sclerosis）